Clinical trial exclusion criterion:
Hypersensitivity to camptothecin or nucleoside analogues.

Annotated entities:
- Condition: "Hypersensitivity"
- Drug: "camptothecin"
- Drug: "nucleoside analogues"